4. Outpatients

The above is a clinical trial inclusion criterion. Annotated with entity spans:
[Parsing_Error: 4.] [Visit: Outpatients]